Clinical trial inclusion criterion:
Fasting LDL-C =70mg/dL or = 160mg/dL at the randomization visit

Annotated entities:
- Measurement: "Fasting LDL-C"
- Value: "=70mg/dL"
- Value: "= 160mg/dL"
- Temporal: "at the randomization visit"
- Temporal: "at the randomization visit"